Clinical trial inclusion criterion:
4. hypertension (systolic blood pressure ≥ 140 or diastolic blood pressure ≥90 mmHg or treatment with antihypertensive drugs).

Entity relations:
- AND("treatment", "antihypertensive drugs")
- Has_value("diastolic blood pressure", "≥90 mmHg")
- Has_value("systolic blood pressure", "≥ 140")
- Subsumes("hypertension", "systolic blood pressure")
- OR("systolic blood pressure", "diastolic blood pressure", "treatment")